Patients with a previous use of IFN anti hepatitis B virus treatment or have NAs drug resistance.

The above is a clinical trial exclusion criterion. Annotated with entity spans:
Patients with a previous use of [Drug: IFN] [Qualifier: anti hepatitis B virus] treatment or have [Drug: NAs drug] [Condition: resistance].